Clinical trial inclusion criterion:
Diagnosis of moderate to severe Ankylosing Spondylitis (AS) with prior documented radiologic evidence fulfilling the Modified New York criteria for AS

Annotated entities:
- Qualifier: "moderate"
- Qualifier: "severe"
- Condition: "Ankylosing Spondylitis (AS)"
- Condition: "radiologic evidence"
- Procedure: "radiologic"
- Temporal: "prior"
- Measurement: "Modified New York criteria for AS"
- Value: "fulfilling"